Clinical trial inclusion criterion:
WHO pulmonary hypertension function II-III with non-responder to calcium channel blockers.

Annotated entities:
- Measurement: "WHO pulmonary hypertension function"
- Value: "II-III"
- Condition: "non-responder to calcium channel blockers"
- Drug: "calcium channel blockers"